Pulmonary air leaks;

The above is a clinical trial exclusion criterion. Annotated with entity spans:
[Condition: Pulmonary air leaks];